Clinical trial exclusion criterion:
Elevated total cholesterol (>350 mg/dL) and/or triglycerides (>500 ng/dL) at time of possible conversion

Entity relations:
- Has_value("total cholesterol", "Elevated")
- Subsumes("Elevated", ">350 mg/dL")
- Has_value("triglycerides", ">500 ng/dL")
- Has_temporal("triglycerides", "at time of possible conversion")